History of solid organ transplantation

The above is a clinical trial exclusion criterion. Annotated with entity spans:
History of [Condition: solid organ transplantation]